一位 30 歲男性，因近 1 年來左側陰囊及鼠蹊疼痛求診。理學檢查發現其左側陰囊出現一些鼓脹的構造，好像一袋蟲（a bag of worms）的徵象；患者平躺時，該現象可減緩，症狀也減輕，但站立時又再出現。以下何者為最可能之診斷？
A. 鼠蹊部疝氣（inguinal hernia）
B. 交通性的陰囊積水（communicating hydrocele）
C. 副睪精液囊腫（epididymal spermatocele）
D. 精索靜脈曲張（varicocele）

正確答案：D. 精索靜脈曲張（varicocele）